Clinical trial inclusion criterion:
Cervical length <=25mm between 18(0) and 23(6) weeks

Entity relations:
- Has_qualifier("Cervical length", "between 18(0) and 23(6) weeks")
- Has_value("Cervical length", "<=25mm")